Clinical trial inclusion criterion:
CMV seropositive

Annotated entities:
- Condition: "CMV seropositive"